Clinical trial exclusion criterion:
On treatment with oral anticoagulant

Entity relations:
- Has_qualifier("anticoagulant", "oral")